醫療人員對呼吸道阻塞病患的急救處置，下列何者錯誤？
A. 病人無意識時，應立即跨跪在病人大腿兩側，兩手掌根重疊放在肚臍稍上方，用力壓腹部 5 下
B. 病人無意識時，應執行類似 CPR 的動作，壓胸與吹氣的部位及次數比均相同
C. 於壓胸後，應檢查口中有無異物，如有則挖除之，如無則試吹氣
D. 對於有意識的呼吸道阻塞急救，除了壓腹部，也可以壓胸和搥背

正確答案：A. 病人無意識時，應立即跨跪在病人大腿兩側，兩手掌根重疊放在肚臍稍上方，用力壓腹部 5 下